Origin Caucasian

The above is a clinical trial inclusion criterion. Annotated with entity spans:
Origin [Condition: Caucasian]